List the core lung matrisome proteins.

LGALS7, 
ASPN, 
HSP90AA1, 
HSP90AB1,
COL1A1, 
SCGB1A1, 
TAGLN, 
PSEN2, 
TSPAN1, 
CTSB, 
AGR2, 
CSPG2,
SERPINB3,
fibronectin,
emilin-1,
versican,
decorin